Clinical trial exclusion criterion:
Use of statins and quinolones in the previous year;

Annotated entities:
- Drug: "statins"
- Drug: "quinolones"
- Temporal: "in the previous year"